DNA 病毒之蛋白質可與調節細胞週期之 p53 蛋白質作用者為：
A. 人類乳頭瘤病毒第十六型（HPV16）之 E6 蛋白質
B. 人類乳頭瘤病毒第十六型（HPV16）之 E7 蛋白質
C. 腺病毒（Adenovirus）之 E1A 蛋白質
D. EB 病毒（Epstein-Barr virus）潛伏性膜蛋白質第一型（LMP1）

正確答案：A. 人類乳頭瘤病毒第十六型（HPV16）之 E6 蛋白質